Clinical trial exclusion criterion:
Patients who currently fulfil criteria for DSM-IV eating disorder, body dysmorphic disorder, current alcohol or substance abuse, or who have a lifetime history of bipolar disorder. Patients with a history of Schizophrenia and other psychotic disorders, Delirium, Dementia, and Amnestic and other cognitive disorders.

Entity relations:
- Has_qualifier("eating disorder", "DSM-IV")
- Has_qualifier("psychotic disorders", "other")
- Has_qualifier("cognitive disorders", "other")
- OR("eating disorder", "body dysmorphic disorder", "alcohol abuse", "substance abuse")
- OR("eating disorder", "bipolar disorder", "Schizophrenia", "psychotic disorders", "Delirium", "Dementia", "Amnestic", "cognitive disorders")